drug or alcohol abuse

The above is a clinical trial exclusion criterion. Annotated with entity spans:
[Condition: drug] or [Condition: alcohol abuse]